Clinical trial exclusion criterion:
Need for a multiorgan transplantation

Annotated entities:
- Mood: "Need for"
- Procedure: "multiorgan transplantation"